Describe Full Spectrum of Intolerance to Loss-of-function (FUSIL)

Full Spectrum of Intolerance to Loss-of-function (FUSIL) is a cross-species gene classification across the full spectrum of essential and non-essential genes. FUSIL is an efficient approach for disease gene discovery.